Clinical trial exclusion criterion:
With multiple sclerosis or other progressive neurological disease

Entity relations:
- Subsumes("progressive neurological disease", "multiple sclerosis")